What causes Scurvy?

Scurvy, or "Barlow's disease", is a widely described disease resulting from vitamin C deficiency